Clinical trial exclusion criteria:
Patient included in an interventional study assessing treatment for active proctitis or distal proctosigmoiditis.
Patient with left sided, colitis or pancolitis.
Patient with severe proctitis (MAYO score ≥ 11 at inclusion).
Patient previously treated with biologics.
Patient treated with immunosuppressive within 1 month before study inclusion.
Patient treated with corticosteroids within 2 weeks before study inclusion.

Annotated entities:
- Condition: "active proctitis"
- Condition: "distal proctosigmoiditis"
- Procedure: "treatment"
- Undefined_semantics: "treatment"
- Condition: "colitis"
- Condition: "pancolitis"
- Qualifier: "left sided"
- Condition: "proctitis"
- Qualifier: "severe"
- Measurement: "MAYO score"
- Value: "≥ 11"
- Temporal: "at inclusion"
- Drug: "biologics"
- Undefined_semantics: "biologics"
- Temporal: "previously"
- Procedure: "treated"
- Drug: "immunosuppressive"
- Temporal: "within 1 month before study inclusion"
- Reference_point: "study inclusion"
- Drug: "corticosteroids"
- Temporal: "within 2 weeks before study inclusion"
- Reference_point: "study inclusion"